Clinical trial inclusion criterion:
At least 70 yrs old

Annotated entities:
- Value: "At least 70 yrs"
- Person: "old"